Prior treatment with Acthar in the past 2mos

The above is a clinical trial exclusion criterion. Annotated with entity spans:
[Temporal: Prior] [Procedure: treatment] with [Drug: Acthar] [Temporal: in the past 2mos]